Healthy patients age 18 and older

The above is a clinical trial inclusion criterion. Annotated with entity spans:
[Condition: Healthy] patients [Person: age] [Value: 18 and older]